emergency surgery

The above is a clinical trial exclusion criterion. Annotated with entity spans:
[Procedure: emergency surgery]